¿Cuándo no debe efectuarse el diagnóstico de trastorno de angustia, según el criterio C del DSM-IV-TR?
1. Cuando las crisis de angustia son recidivantes.
2. Cuando las crisis de angustia son inesperadas.
3. Cuando las crisis de angustia se acompañan de la aparición, durante un mínimo de un mes, de preocupaciones persistentes de padecer nuevas crisis.
4. Cuando las crisis de angustia se acompañan de la aparición, durante un mínimo de un mes, de posibles implicaciones o consecuencias.
5. Cuando las crisis de angustia se consideran secundarias a los efectos fisiológicos directos de una enfermedad.

Respuesta correcta: 5. Cuando las crisis de angustia se consideran secundarias a los efectos fisiológicos directos de una enfermedad.